= 3 UTIs within the last 12 months or = 2 UTIs within the last 6 months;

The above is a clinical trial inclusion criterion. Annotated with entity spans:
[Multiplier: = 3] [Condition: UTIs] [Temporal: within the last 12 months] or [Multiplier: = 2] [Condition: UTIs] [Temporal: within the last 6 months];